有關瀉藥（laxatives）之敘述中，下列那些正確？①纖維素禁用於巨結腸（megacolon）病人   ② bisacodyl 應避免與牛奶同時服用 ③礦物油應於睡覺時使用
A. 只有①②正確
B. 只有①③正確
C. 只有②③正確
D. ①②③均正確

正確答案：A. 只有①②正確